一位 38 歲女性因體檢發現血鈣為 11.2 mg/dL，病人沒有症狀，則下一步檢查不必包括：
A. 血中副甲狀腺素
B. 血中鹼性磷酸酶（alkaline phosphatase）
C. 血中膽固醇
D. 尿中鈣

正確答案：C. 血中膽固醇